What is the function of the NIPBL factor in genome conformation?

NIPBL loads cohesin onto chromatin. The NIPBL protein is required for the loading of cohesin onto chromatin. A cohesin-loading factor (NIPBL) is one of important regulatory factors in the maintenance of 3D genome organization and function, by interacting with a large number of factors, e.g. cohesion, CCCTC-binding factor (CTCF) or cohesin complex component. The mechanism of this gene regulation remains unclear, but NIPBL and cohesin have been reported to affect long-range chromosomal interactions, both independently and through interactions with CTCF.